En condiciones fisiológicas, la estructura secundaria del ADN más frecuente en las células encariotas es:
1. B-ADN.
2. Z-ADN.
3. A-ADN.
4. G-ADN.
5. H-ADN.

Respuesta correcta: 1. B-ADN.